下列何者是 varenicline 的臨床用途？
A. 戒菸
B. 青光眼
C. 重症肌無力
D. 老年失智症

正確答案：A. 戒菸